Clinical trial exclusion criterion:
2. Screening tools: SCID Screen Patient Questionnaire. Potential diagnoses will be further evaluated by a counsellor.

Annotated entities:
- Parsing_Error: "2."
- Not_a_criteria: "Screening tools: SCID Screen Patient Questionnaire."
- Parsing_Error: "Screening tools: SCID Screen Patient Questionnaire."
- Not_a_criteria: "Potential diagnoses will be further evaluated by a counsellor."